Clinical trial exclusion criterion:
Known intolerance to the doxycycline Body weight <40 kg Pregnancy or breastfeeding History of severe allergic reaction or anaphylaxis Alcohol or drug abuse

Annotated entities:
- Condition: "intolerance to the doxycycline"
- Drug: "doxycycline"
- Measurement: "Body weight"
- Value: "<40 kg"
- Condition: "Pregnancy"
- Observation: "breastfeeding"
- Condition: "allergic reaction"
- Qualifier: "severe"
- Condition: "anaphylaxis"
- Condition: "Alcohol abuse"
- Condition: "drug abuse"
- Temporal: "History of"